Clinical trial inclusion criterion:
cycle length 25-34 days

Entity relations:
- Has_value("cycle length", "25-34 days")